Clinical trial exclusion criterion:
hemodynamically unstable heart failure

Entity relations:
- Has_qualifier("heart failure", "hemodynamically unstable")